Clinical trial inclusion criterion:
Participants considered in stable health in the opinion of the investigator

Annotated entities:
- Observation: "stable health"
- Non-query-able: "in the opinion of the investigator"